Clinical trial inclusion criterion:
plans to receive care in the Community Health Center during the next year

Entity relations:
- AND("receive care", "Community Health Center")
- Has_mood("receive care", "plans to")
- Has_temporal("receive care", "during the next year")